Clinical trial inclusion criterion:
Lobar pneumonia or pneumoniae with pleural effusion

Annotated entities:
- Condition: "Lobar pneumonia"
- Condition: "pneumoniae"
- Condition: "pleural effusion"